Clinical trial inclusion criteria:
eGFR>60 ml/min healthy volunteers type 2 diabetes patients who otherwise healthy

Annotated entities:
- Measurement: "eGFR"
- Value: ">60 ml/min"
- Condition: "healthy"
- Condition: "type 2 diabetes"
- Line: "eGFR>60 ml/min"
- Line: "healthy volunteers"
- Line: "type 2 diabetes patients who otherwise healthy"